下列那一項不屬於治療應力性尿失禁手術的方法？
A. 恥骨後尿道固定術
B. 恥骨陰道懸吊手術
C. 無張力性人工陰道吊帶
D. 全子宮切除手術

正確答案：D. 全子宮切除手術